What is the function of emergency granulopoiesis?

Emergency granulopoiesis is the enhanced production of neutrophils by hematopoietic stem and progenitor cells upon infection . It is widely considered a homoeostatic mechanism for replacing exhausted leukocytes . ARIH2 encodes TRIAD1, an E3 ubiquitin ligase required for termination of emergency granulopsis and leukemia suppressor function in  MLL1 .